Si se añade cobre metálico a una disolución de cloruro de hierro (III) se produce:
1. Un precipitado de cloruro de cobre (II).
2. Una disolución de cloruro de cobre (II) y cloruro de hierro (II).
3. Un precipitado de cloruro de hierro (II).
4. Un precipitado de hierro metálico.
5. Una disolución de cloruro de cobre (I) y cloruro de hierro (II).

Respuesta correcta: 2. Una disolución de cloruro de cobre (II) y cloruro de hierro (II).